一名 59 歲男性發生大腦的分水嶺梗塞（watershed infarct），此病變最好發於：
A. 前大腦動脈與中大腦動脈交界處
B. 中大腦動脈與後大腦動脈交界處
C. 高血壓發作時
D. 癲癇發作時

正確答案：A. 前大腦動脈與中大腦動脈交界處